Clinical trial exclusion criterion:
Subjects with non-functional CICC or PICC distal ports

Entity relations:
- Has_qualifier("CICC distal ports", "non-functional")
- OR("CICC distal ports", "PICC distal ports")